Clinical trial inclusion criterion:
If entering the study as an inpatient, hospitalization was recent

Entity relations:
- Has_temporal("hospitalization", "recent")
- AND("inpatient", "hospitalization")